Intravenous (IV) iron administered within 4 weeks prior to Screening

The above is a clinical trial exclusion criterion. Annotated with entity spans:
[Qualifier: Intravenous] ([Qualifier: IV]) [Drug: iron] administered [Temporal: within 4 weeks prior to Screening]